Fever, elevated white cell count, or other evidence of active infection

The above is a clinical trial exclusion criterion. Annotated with entity spans:
[Condition: Fever], [Value: elevated] [Measurement: white cell count], or other [Mood: evidence] of [Condition: active infection]